Clinical trial inclusion criterion:
Axial spondyloarthritis (ASAS criteria) and radiologic sacroiliitis as detected either by MRI or X-ray.

Annotated entities:
- Condition: "Axial spondyloarthritis"
- Qualifier: "ASAS criteria"
- Procedure: "radiologic"
- Condition: "sacroiliitis"
- Procedure: "MRI"
- Procedure: "X-ray"